Which topoisomerase is essential in yeast?

Yeast DNA topoisomerase II is encoded by a single-copy, essential gene. Disruption of one copy of the gene in a diploid yeast creates a recessive lethal mutation, indicating that the single DNA topoisomerase II gene of yeast has an essential function.